Clinical trial exclusion criterion:
Alcoholism

Annotated entities:
- Condition: "Alcoholism"